Covid-19 is though to have arisen from what species?

COVID-19 caused by SARS-CoV-2 most likely originated in bats and transmitted to humans through a possible intermediate host.